Clinical trial inclusion criterion:
Patients age 8- 18 years 2) Patients undergoing minimally invasive pectus excavatum repair via Nuss procedure 3) American Society of Anesthesiology Status I-III

Entity relations:
- Has_value("age", "8- 18 years")
- Has_qualifier("minimally invasive pectus excavatum repair", "Nuss procedure")
- Has_value("American Society of Anesthesiology Status", "I-III")